Clinical trial inclusion criterion:
> 18 years of age and < 70 years of age

Annotated entities:
- Person: "age"
- Value: "> 18 years and < 70 years"